Clinical trial inclusion criterion:
Presence of chronic HCV infection based on chart review will be defined as positive for anti-HCV antibody or HCV RNA at least 6 months before screening.

Annotated entities:
- Temporal: "chronic"
- Condition: "HCV infection"
- Measurement: "anti-HCV antibody"
- Value: "positive"
- Measurement: "HCV RNA"
- Temporal: "at least 6 months before screening"